下列何種病人不適用小型鍵盤（smaller keyboards）？
A. 上肢關節活動受限者
B. 上肢顫抖（tremor）者
C. 以口含筆（mouth stick）鍵	者
D. 以單手鍵	者

正確答案：B. 上肢顫抖（tremor）者